Clinical trial inclusion criterion:
diabetic patient;

Annotated entities:
- Condition: "diabetic"